Clinical trial inclusion criterion:
no history of anesthesia medication allergy.

Entity relations:
- AND("allergy", "anesthesia medication")
- Has_temporal("allergy", "history")
- Has_negation("allergy", "no")